Clinical trial exclusion criteria:
Patients with a contraindication to VCE (small bowel strictures, oropharyngeal dysphagia, pregnancy, patients who are not surgical candidates)
Endoscopic insertion of video capsule endoscope
Inpatient procedures for active GI bleeding
Patients with fluid restriction or who are unable to drink up to 900 ml of fluid within 10 minutes prior to the VCE

Annotated entities:
- Condition: "contraindication"
- Procedure: "VCE"
- Condition: "small bowel strictures"
- Condition: "oropharyngeal dysphagia"
- Condition: "pregnancy"
- Negation: "not"
- Observation: "surgical candidates"
- Procedure: "Endoscopic insertion"
- Device: "video capsule endoscope"
- Procedure: "Inpatient procedures"
- Condition: "GI bleeding"
- Qualifier: "active"
- Observation: "fluid restriction"
- Observation: "unable to drink"
- Temporal: "prior to the VCE"
- Procedure: "VCE"
- Reference_point: "the VCE"